Clinical trial inclusion criterion:
Willing to join in and sign the informed consent form.

Annotated entities:
- Informed_consent: "Willing to join in and sign the informed consent form"